Clinical trial inclusion criterion:
Systolic blood pressure 90-140 mmHg

Entity relations:
- Has_value("Systolic blood pressure", "90-140 mmHg")